sleep disordered breathing (diagnosed OSA, obesity hypoventilation syndrome)

The above is a clinical trial exclusion criterion. Annotated with entity spans:
[Condition: sleep disordered breathing] (diagnosed [Condition: OSA], [Condition: obesity hypoventilation syndrome])